Clinical trial exclusion criterion:
Women only: Cannot be pregnant or nursing at baseline or plan to become pregnant during the course of the study

Annotated entities:
- Person: "Women"
- Pregnancy_considerations: "Cannot be pregnant or nursing at baseline or plan to become pregnant during the course of the study"